Known or suspected history of malignant hyperthermia

The above is a clinical trial exclusion criterion. Annotated with entity spans:
[Mood: Known] or [Mood: suspected] [Temporal: history] of [Condition: malignant hyperthermia]